Which plant is khellin extracted from?

Khellin is extracted from the seeds of the plant Ammi visnaga.